Clinical trial inclusion criterion:
Current or ex-smokers with a smoking history of at least 10 pack years (number of pack years = [number of cigarettes per day / 20] x number of years smoked, e.g., 20 cigarettes per day for 10 years, or 10 cigarettes per day for 20 years).

Entity relations:
- Has_value("smoking history", "10 pack years")
- Has_temporal("smokers", "Current")
- OR("Current", "ex")